引發咳嗽反射最敏感的呼吸道黏膜位於：
A. 隆凸（carina）
B. 氣管（trachea）
C. 主支氣管（main bronchus）
D. 節支氣管（segmental bronchus）

正確答案：A. 隆凸（carina）